Subject is considered to be a part of a vulnerable population (eg. prisoners or those without sufficient mental capacity).

The above is a clinical trial exclusion criterion. Annotated with entity spans:
Subject is considered to be a [Person: part of a vulnerable population] (eg. [Person: prisoners] or those [Condition: without sufficient mental capacity]).